下列有關產生抗體多樣化（diversity）的原理，那一項描述錯誤？
A. 體細胞高度突變（somatic hyper-mutation）發生於基因重組（gene rearrangement）之前
B. 體細胞高度突變（somatic hyper-mutation）可以發生於抗體的重鏈（heavy chain）以及輕鏈（light chain）部位
C. 利用酵素將四種核酸（nucleotides）任意加入剪接部位，可以造成連接多樣化（junctional diversity）
D. 相同重鏈（heavy chain）與不同輕鏈（light chain）之組合亦可造成抗體多樣化（diversity）

正確答案：A. 體細胞高度突變（somatic hyper-mutation）發生於基因重組（gene rearrangement）之前